關於基底核（basal ganglia）之敘述，下列何者錯誤？
A. 黑質（substantia nigra）投射到殼部（putamen）
B. 丘腦腹前核（ventral anterior nucleus of thalamus）可參與直接（direct）和間接迴路（indirect pathway）
C. 黑質（substantia nigra）興奮直接迴路（direct pathway）
D. 間接迴路（indirect pathway）不受黑質（substantia nigra）調控

正確答案：D. 間接迴路（indirect pathway）不受黑質（substantia nigra）調控